Clinical trial inclusion criterion:
IQ greater than or equal to 70

Annotated entities:
- Measurement: "IQ"
- Value: "greater than or equal to 70"